Clinical trial inclusion criterion:
patients aged >18, <75, left ventricle ejection fraction (LVEF) >50%, multivessel coronary disease detected by coronarography, indication to receive a CABG, stable CAD. All diabetics and non diabetics.

Annotated entities:
- Person: "aged"
- Value: ">18, <75"
- Measurement: "left ventricle ejection fraction"
- Measurement: "LVEF"
- Value: ">50%"
- Condition: "multivessel coronary disease"
- Procedure: "coronarography"
- Procedure: "CABG"
- Mood: "indication to receive"
- Qualifier: "stable"
- Condition: "CAD"
- Condition: "diabetics"
- Condition: "non diabetics"